Clinical trial exclusion criterion:
Documented chronic peripheral arterial disease preventing the use of the femoral technique;

Annotated entities:
- Qualifier: "chronic"
- Condition: "peripheral arterial disease"
- Procedure: "femoral technique"
- Negation: "preventing"